Female parturient or nursing

The above is a clinical trial exclusion criterion. Annotated with entity spans:
[Person: Female] [Condition: parturient] or [Condition: nursing]